What disease is associated with Anticitrullinated peptide antibodies (ACPAs)?

The aim of this study was to evaluate the presence of autoantibodies to cyclic citrullinated synthetic peptides (ACPAs) in the sputum of patients with long-standing rheumatoid arthritis.